Clinical trial inclusion criteria:
Patients on regular hemodialysis 3sessions/wk.
Recent catheter insertion at beginning of the study.
Both males and females.
Age group = 18 ys.

Annotated entities:
- Procedure: "regular hemodialysis"
- Multiplier: "3sessions/wk"
- Procedure: "catheter insertion"
- Temporal: "at beginning of the study"
- Temporal: "Recent"
- Reference_point: "beginning of the study"
- Person: "males"
- Person: "females"
- Person: "Age group"
- Value: "= 18 ys"